Se denomina esterotipia a:
1. Gestos bucolinguales extraños.
2. Repetición reiterada e innecesaria de un acto.
3. Movimientos muy aparatosos que aumentan la expresividad de los gestos.
4. Agitaciones psicóticas muy intensas.
5. Gestos aparatosos acompañados de palabras soeces.

Respuesta correcta: 2. Repetición reiterada e innecesaria de un acto.